History of having received any systemic anti-neoplastic (including radiation) or immunomodulatory treatment (including systemic corticosteroids) <=6 months prior to the first dose of study drug or the expectation that such treatment will be needed at any time during the study.

The above is a clinical trial exclusion criterion. Annotated with entity spans:
History of having received any [Qualifier: systemic] [Procedure: anti-neoplastic] (including [Procedure: radiation]) or [Procedure: immunomodulatory treatment] (including [Qualifier: systemic] [Drug: corticosteroids]) [Temporal: <=6 months prior to the first dose of study drug] or the [Mood: expectation] that such [Procedure: treatment] [Mood: will be needed] [Temporal: at any time during the study].